對於肝腎症候群（hepatorenal syndrome）的敘述，何者正確？
A. 肝腎症候群可分為第一型及第二型。 第一型的特徵是比較穩定，預後較佳，第二型的特徵是腎功能在1～2
B. 肝腎症候群通常是發生於沒有腹水的病人
C. 可用來治療肝腎症候群的藥物有terlipressin
D. 由於腎實質已經受損，就算是進行肝臟移植，肝腎症候群也不會改善

正確答案：C. 可用來治療肝腎症候群的藥物有terlipressin